What is Amyand hernia?

An Amyand hernia is a rare disease where the appendix is found within an inguinal hernia sac, which may or may not contain other abdominal contents or pathologic inflammatory changes.